下列有關眼球結構與發育來源的配對，何者錯誤？
A. 間質組織（mesenchyme）－睫狀肌（ciliary muscle）
B. 間質組織－瞳孔舒張/括約肌（dilator/sphincter pupillae）
C. 神經嵴（neural crest）－虹膜基質（stroma of iris）
D. 體表外胚層（surface ectoderm）－晶狀體泡（lens vesicle）

正確答案：B. 間質組織－瞳孔舒張/括約肌（dilator/sphincter pupillae）